Clinical trial exclusion criterion:
Comorbidities such as uncontrolled cardiovascular disease, i.e., unstable systemic arterial hypertension, coronary artery disease; previous stroke; OSA; pneumothorax in the last 2 months.

Annotated entities:
- Condition: "Comorbidities"
- Condition: "cardiovascular disease"
- Qualifier: "uncontrolled"
- Condition: "systemic arterial hypertension"
- Qualifier: "unstable"
- Condition: "coronary artery disease"
- Condition: "stroke"
- Qualifier: "previous"
- Condition: "OSA"
- Condition: "pneumothorax"
- Temporal: "in the last 2 months"